Clinical trial exclusion criterion:
Recent coronary artery intervention or other factors suggesting clinical instability (ECG, clinical or laboratory findings).

Annotated entities:
- Procedure: "coronary artery intervention"